有關上肢截斷所容許的缺血時間取決於其內含物所能忍受的缺血時間，其中肌肉所能忍受的缺血時間最長是幾個小時？
A. 10 小時
B. 8 小時
C. 6 小時
D. 4 小時

正確答案：C. 6 小時